Patients with a medical or psychiatric illness that would preclude study or informed consent and/or history of noncompliance to medical regimens or inability or unwillingness to return for all scheduled visits

The above is a clinical trial exclusion criterion. Annotated with entity spans:
Patients with a [Condition: medical] or [Condition: psychiatric illness] that would [Observation: preclude study] or [Observation: informed consent] and/or history of [Observation: noncompliance to medical regimens] or [Mood: inability] or [Mood: unwillingness to return for all scheduled visit]s